Subjects fluent in English or when not fluent, an appropriate translator is present

The above is a clinical trial inclusion criterion. Annotated with entity spans:
[Post-eligibility: Subjects fluent in English or when not fluent, an appropriate translator is present]